下列有關惡性貧血（pernicious anemia）病人的敘述，何者錯誤？
A. 由於 Vit B12攝取不足造成
B. 網狀紅血球降低
C. 間接膽紅素（indirect bilirubin）升高
D. 可出現神經學症狀

正確答案：A. 由於 Vit B12攝取不足造成